依照我國行政院衛生署公布的健康食品管理法（2006 年）對健康食品上市的規範為何？
A. 提供特殊營養素或具有特定保健功效，特別加以標示或廣告，以治療、矯正人類疾病為目的
B. 具有保健功效，並標示或廣告其具該功效之食品
C. 具有特定成分，對特定疾病有療效者
D. 符合食品衛生管理法之優良食品

正確答案：B. 具有保健功效，並標示或廣告其具該功效之食品